Clinical trial exclusion criterion:
Serious or unstable cardiac, renal, neurologic, cerebrovascular, metabolic, or pulmonary disease

Annotated entities:
- Condition: "cardiac disease"
- Condition: "renal disease"
- Condition: "neurologic disease"
- Condition: "cerebrovascular disease"
- Condition: "metabolic disease"
- Condition: "pulmonary disease"
- Qualifier: "unstable"
- Qualifier: "Serious"